醫師發現其病患為 AIDS 帶原者，依照法令，應該通知下列何者？
A. 病患之合法配偶
B. 當地之主管機關
C. 醫師有保密義務，除非病患同意，否則不得告知任何人
D. 有可能與病患發生性行為之人

正確答案：B. 當地之主管機關